A un paciente con colitis ulcerosa con afectación hasta el colon transverso se le realiza una colonoscopia de cribado de cáncer colorrectal. La colonoscopia no muestra signos de actividad inflamatoria. Se realizaron múltiples biopsias cada 10 cm. Las biopsias fueron revisadas por 2 patólogos expertos demostrando un foco de displasia de alto grado en una de las biopsias realizadas en el colon sigmoide. ¿Qué indicaría a continuación?
1. Repetir la colonoscopia para confirmar el diagnóstico.
2. Vigilancia intensiva con colonoscopia cada 3 a 6 meses.
3. Repetir la exploración y realizar una cromoendoscopia para identificar la lesión y realizar una mucosectomía endoscópica.
4. Proctocolectomía total.
5. Tratamiento con mesalazina a dosis de 2-3 gramos al día y repetir la exploración a los 3 a 6 meses.

Respuesta correcta: 4. Proctocolectomía total.